秋水仙素（colchicine）會抑制微管蛋白（tubulin）之聚合，使其無法形成微管（microtubule）。下列細胞活動何者不受其直接抑制？
A. 有絲分裂（mitosis）
B. 神經元的軸突運輸（axonal transport）
C. 肌肉收縮
D. 分泌小泡（secretory vesicle）在細胞內的運送

正確答案：C. 肌肉收縮